持續性妊娠滋養層細胞疾病（persistent gestational trophoblastic disease）經過化學治療後，如果再懷孕時，通常會如何？
A. 胎兒畸形率增加
B. 流產發生率增加
C. 正常生育功能
D. 早產增加

正確答案：C. 正常生育功能